Non papillary gross features of the tumor

The above is a clinical trial exclusion criterion. Annotated with entity spans:
[Condition: Non papillary gross features] of the [Condition: tumor]